Clinical trial exclusion criterion:
i. Warfarin, phenprocoumon: increase bleeding tendency ii. Increase blood concentration of phenytoin iii. sorivudine: inhibit DPD -> increase toxicity according to fluoropyrimidine iv. allopurinol : decrease activity of S-1

Entity relations:
- Has_value("blood concentration of phenytoin", "Increase")
- Has_value("bleeding tendency", "increase")
- OR("Warfarin", "phenprocoumon")
- OR("sorivudine", "allopurinol", "fluoropyrimidine")